Clinical trial inclusion criterion:
Neutrophils ≥1.5 x 109/L.

Entity relations:
- Has_value("Neutrophils", "≥1.5 x 109/L")